Clinical trial exclusion criterion:
Known or suspected systemic hypersensitivity to any of the vaccine components, or history of a life-threatening reaction to the vaccine used in the trial or to a vaccine containing any of the same substances

Entity relations:
- AND("systemic hypersensitivity", "vaccine components")
- AND("life-threatening reaction", "vaccine")
- Has_qualifier("vaccine", "used in the trial")